History or other evidence of bleeding from esophageal varices or other conditions consistent with decompensated liver disease.

The above is a clinical trial exclusion criterion. Annotated with entity spans:
History or other evidence of [Condition: bleeding] from [Condition: esophageal varices] or [Qualifier: other] [Condition: conditions consistent with decompensated liver disease].